Clinical trial exclusion criterion:
Liver disease (known history of hepatitis B or C, cirrhosis, nonalcoholic steatohepatitis, history of alcoholism, ALT/AST greater than 3 times upper limit of normal in the past 3 months)

Entity relations:
- Has_temporal("alcoholism", "history")
- Has_value("ALT/AST", "greater than 3 times upper limit of normal")
- Has_temporal("ALT/AST", "in the past 3 months")
- Has_temporal("hepatitis B", "history")
- Subsumes("Liver disease", "hepatitis B")
- OR("hepatitis B", "hepatitis C")
- OR("hepatitis B", "cirrhosis", "nonalcoholic steatohepatitis", "alcoholism", "ALT/AST")